Clinical trial exclusion criterion:
Acute bacterial endocarditis and endocarditis lenta.

Entity relations:
- OR("Acute bacterial endocarditis", "endocarditis lenta")